Clinical trial exclusion criterion:
Patients with cardiac disease or using anti-arrhythmic agents

Entity relations:
- OR("cardiac disease", "anti-arrhythmic agents")